Clinical trial exclusion criterion:
Inability to use PCA

Annotated entities:
- Condition: "Inability to use"
- Procedure: "PCA"